Clinical trial exclusion criterion:
concomitant treatments with medication known to have drug interactions with dronabinol, such as, central nervous system depressants (barbiturates, benzodiazepines, buspirone, lithium, etc) and anticholinergic agents (atropine, scopolamine, antihistamines, etc).

Annotated entities:
- Procedure: "treatments"
- Drug: "medication"
- Condition: "drug interactions"
- Drug: "dronabinol"
- Drug: "central nervous system depressants"
- Drug: "barbiturates"
- Drug: "benzodiazepines"
- Drug: "buspirone"
- Drug: "lithium"
- Drug: "anticholinergic agents"
- Drug: "atropine"
- Drug: "scopolamine"
- Drug: "antihistamines"